Clinical trial exclusion criterion:
Dexamethasone use within last 3 months

Annotated entities:
- Drug: "Dexamethasone"
- Temporal: "within last 3 months"